Which R package is used for the detection of chromosomal abnormalities from microarray data?

CAFE is an R package for the detection of gross chromosomal abnormalities from gene expression microarray data.